Clinical trial exclusion criteria:
Invasive hepatocellular carcinoma without any isolated tumor
Disease needing 2 injections of Therasphere
Thrombosis extending into the porta(thrombosis of one of left or right branch authorized), extra hepatic metastasis
Previous treatment by chemoembolization, radiofrequency less than 3 months before radioembolization
No antiangiogenic concomitant treatment, 15 days before and 15 days after radioembolization, including Sorafenib
Associated disease which could prevent patient from receiving treatment
RMI contre-indication(particle or metal prosthesis, pacemaker, claustrophobia) or contrast product contre-indication (allergy)
Patient already participating in an other therapeutic trial with an experimental drug
Pregnant or childbearing potential women or breastfeeding women
minors, persons deprived of liberty or protected adults (maintenance of justice, guardianship or supervision) Unable to comply with trial medical follow-up for geographical, social or psychological reasons
Unable to sign an informed consent

Annotated entities:
- Condition: "hepatocellular carcinoma"
- Qualifier: "Invasive"
- Condition: "isolated tumor"
- Negation: "without"
- Context_Error: "Disease needing 2 injections of Therasphere"
- Condition: "Thrombosis"
- Qualifier: "extending into the porta"
- Condition: "thrombosis"
- Qualifier: "left branch"
- Qualifier: "right branch"
- Grammar_Error: "authorized"
- Negation: "authorized"
- Condition: "extra hepatic metastasis"
- Procedure: "chemoembolization"
- Procedure: "radiofrequency"
- Temporal: "less than 3 months before radioembolization"
- Reference_point: "radioembolization"
- Temporal: "15 days before radioembolization"
- Temporal: "15 days after radioembolization"
- Negation: "No"
- Procedure: "antiangiogenic treatment"
- Drug: "Sorafenib"
- Condition: "Associated disease"
- Qualifier: "could prevent patient from receiving treatment"
- Undefined_semantics: "Associated disease which could prevent patient from receiving treatment"
- Procedure: "RMI"
- Condition: "RMI contre-indication"
- Undefined_semantics: "RMI contre-indication"
- Context_Error: "Patient already participating in an other therapeutic trial with an experimental drug"
- Condition: "Pregnant"
- Condition: "childbearing potential"
- Person: "women"
- Observation: "breastfeeding"
- Person: "women"
- Non-query-able: "minors, persons deprived of liberty or protected adults (maintenance of justice, guardianship or supervision) Unable to comply with trial medical follow-up for geographical, social or psychological reasons"
- Person: "minors"
- Post-eligibility: "Unable to sign an informed consent"